18 years or older

The above is a clinical trial inclusion criterion. Annotated with entity spans:
[Value: 18] [Person: years] or older